With any acute coronary syndrome complicated with acute pulmonary edema, cardiogenic shock and / or malignant ventricular arrhythmias.

The above is a clinical trial exclusion criterion. Annotated with entity spans:
With any [Condition: acute coronary syndrome] complicated with [Condition: acute pulmonary edema], [Condition: cardiogenic shock] and / or [Qualifier: malignant] [Condition: ventricular arrhythmias].